Clinical trial inclusion criterion:
HIV controlled on therapy for at least 12 weeks

Annotated entities:
- Condition: "HIV"
- Qualifier: "controlled"
- Temporal: "at least 12 weeks"